What part of the body is affected by Meniere's disease?

The inner ear is the body part that is associated with Meniere's disease.